Clinical trial inclusion criterion:
Women age 18-45

Annotated entities:
- Person: "Women"
- Person: "age"
- Value: "18-45"